Use of antihistamine within the past 72 hours

The above is a clinical trial exclusion criterion. Annotated with entity spans:
Use of [Drug: antihistamine] [Temporal: within the past 72 hours]